下列何者是組織結構蛋白（structural proteins）缺損引起的遺傳性疾病？
A. 埃勒斯－當洛症候群（Ehlers-Danlos syndrome）
B. 黏多醣貯積症（mucopolysaccharidoses）
C. 高雪氏症（Gaucher disease）
D. 戴－薩克斯症（Tay-Sachs disease）

正確答案：A. 埃勒斯－當洛症候群（Ehlers-Danlos syndrome）